At the cluster level, ED physicians practicing at a participating site will be eligible.

The above is a clinical trial inclusion criterion. Annotated with entity spans:
[Non-query-able: At the cluster level, ED physicians practicing at a participating site will be eligible.]